Serum haemoglobin of 9.5 to 14.0 g/dL

The above is a clinical trial inclusion criterion. Annotated with entity spans:
[Measurement: Serum haemoglobin] of [Value: 9.5 to 14.0 g/dL]